Immunosuppressive therapy, including cytotoxic agents within 14 days of first dose of 852A (nitrosoureas within 30 days of first dose)

The above is a clinical trial exclusion criterion. Annotated with entity spans:
[Procedure: Immunosuppressive therapy], including [Drug: cytotoxic agents] [Temporal: within 14 days of first dose] of [Drug: 852A] ([Drug: nitrosoureas] [Temporal: within 30 days of first dose])